Patients with chronic heart failure present for at least 12 months

The above is a clinical trial inclusion criterion. Annotated with entity spans:
Patients with [Condition: chronic heart failure] present [Temporal: for at least 12 months]